In which cell organelle is the SAF-A protein localized?

The SAF-A protein localizes to the nucleus where it promotes ribosome biogenesis